Clinical trial inclusion criterion:
Subject is capable of understanding and complying with protocol demands and able to sign and date the informed consent

Annotated entities:
- Non-query-able: "Subject is capable of understanding and complying with protocol demands and able to sign and date the informed consent"
- Post-eligibility: "Subject is capable of understanding and complying with protocol demands and able to sign and date the informed consent"